What biologic process in the body is associated with Mast cells?

Mast cells (MCs) are innate immune cells that are a major source of costimulatory signals and inflammatory mediators in the intestinal mucosa.